Clinical trial exclusion criterion:
Conditions which render a subject ineligible for the study at the discretion of the investigator

Annotated entities:
- Non-representable: "Conditions which render a subject ineligible for the study at the discretion of the investigator"